Prior receipt of investigational anti-HIV vaccine

The above is a clinical trial exclusion criterion. Annotated with entity spans:
[Temporal: Prior] receipt of [Qualifier: investigational] [Drug: anti-HIV vaccine]